current or recent (within one week of surgery) systemic antibiotic use, intolerance to both clindamycin and cephalexin, discovery of a persistent cutaneous malignancy at the site of the defect following the reconstructive procedure and previous reconstruction at the site of the skin/soft-tissue defect.

The above is a clinical trial exclusion criterion. Annotated with entity spans:
[Temporal: current] or [Temporal: recent] ([Temporal: within one week of surgery]) systemic [Drug: antibiotic] use, [Condition: intolerance] to both [Drug: clindamycin] and [Drug: cephalexin], discovery of a [Condition: persistent cutaneous malignancy] at the [Qualifier: site of the defect] [Temporal: following the reconstructive procedure] and previous reconstruction at the site of the skin/soft-tissue defect.